Failure to have fully recovered (that is, less than or equal to [<=] Grade 1 toxicity) from the reversible effects of prior chemotherapy.

The above is a clinical trial exclusion criterion. Annotated with entity spans:
[Negation: Failure] to have [Condition: fully recovered] (that is, [Value: less than or equal to [<=] Grade 1] [Measurement: toxicity]) from the reversible effects of prior [Procedure: chemotherapy].